Where in the cell do we find the protein Cep135?

centrosome